Clinical trial inclusion criterion:
participation in another investigational drug study

Annotated entities:
- Post-eligibility: "participation in another investigational drug study"